Clinical trial exclusion criterion:
Treprostinil contraindications: Known hypersensitivity to treprostinil or any of the excipients, Pulmonary arterial hypertension related to veno-occlusive disease, Congestive heart failure due to severe left ventricular dysfunction, Severe hepatic insufficiency (Child-Pugh stage C), Evolving gastrointestinal ulcer, intracranial hemorrhage, recent trauma or other clinical condition that may lead to bleeding, Congenital or acquired valvular abnormalities with cardiac repercussions, Severe ischemic heart disease or unstable angina; Myocardial infarction in the last six months; Decompensated cardiac insufficiency not medically controlled; Severe arrhythmias; Cerebrovascular lesions (such as transient ischemic attack, stroke) that occurred within the last three months.

Entity relations:
- AND("contraindications", "Treprostinil")
- AND("hypersensitivity", "treprostinil")
- AND("Pulmonary arterial hypertension", "veno-occlusive disease")
- Has_qualifier("left ventricular dysfunction", "severe")
- Has_value("Child-Pugh", "stage C")
- Subsumes("Severe", "Child-Pugh")
- Has_qualifier("hepatic insufficiency", "Severe")
- Has_temporal("trauma", "recent")
- Has_qualifier("Congenital valvular abnormalities", "with cardiac repercussions")
- Has_qualifier("acquired valvular abnormalities", "with cardiac repercussions")
- Has_qualifier("ischemic heart disease", "Severe")
- Has_temporal("Myocardial infarction", "in the last six months")
- Has_qualifier("arrhythmias", "Severe")
- Subsumes("Cerebrovascular lesions", "transient ischemic attack")
- Has_temporal("Cerebrovascular lesions", "within the last three months")
- AND("intracranial hemorrhage", "trauma")
- Subsumes("trauma", "clinical condition that may lead to bleeding")
- OR("treprostinil", "any of the excipients")
- OR("transient ischemic attack", "stroke")
- OR("Pulmonary arterial hypertension", "Congestive heart failure", "left ventricular dysfunction", "hepatic insufficiency", "intracranial hemorrhage", "gastrointestinal ulcer")
- OR("clinical condition that may lead to bleeding", "unstable angina", "Congenital valvular abnormalities", "acquired valvular abnormalities", "Myocardial infarction", "Decompensated cardiac insufficiency", "arrhythmias", "Cerebrovascular lesions", "ischemic heart disease")